Clinical trial exclusion criterion:
recent or concomitant use of corticosteroids

Annotated entities:
- Temporal: "recent"
- Temporal: "concomitant"
- Drug: "corticosteroids"